造成二尖瓣狹窄最常見的原因為何？
A. 先天性
B. 嚴重之二尖瓣環鈣化
C. 自體免疫性疾病（如：SLE、RA）
D. 風濕熱

正確答案：D. 風濕熱